Clinical trial inclusion criterion:
1. Age 18-80 years

Entity relations:
- Has_value("Age", "18-80 years")